直腸上段的淋巴主要匯流入下列那個淋巴結？
A. 髂內淋巴結（internal iliac lymph nodes）
B. 腰淋巴結（lumbar lymph nodes）
C. 腹股溝淺淋巴結（superficial inguinal lymph nodes）
D. 腸繫膜下淋巴結（inferior mesenteric lymph nodes）

正確答案：D. 腸繫膜下淋巴結（inferior mesenteric lymph nodes）